¿Cuál de los siguientes elementos es más central en el modelo cognitivo de los Trastornos Obsesivos Compulsivos?:
1. La ausencia de relación entre las obsesiones y las valoraciones o creencias desadaptativas.
2. La hipervigilancia a los estímulos amenazantes del medio.
3. La creencia desadaptativa de tener excesiva responsabilidad.
4. Las expectativas de daño y ansiedad.

Respuesta correcta: 3. La creencia desadaptativa de tener excesiva responsabilidad.